嬰兒玫瑰疹（roseola infantum）或稱 exanthem subitum 在發疹前會突然出現幾天的高燒，請問下列何種病毒會造成此疾病？
A. Parvovirus B19
B. Human herpesvirus-6
C. Rubella virus
D. Varicella-zoster virus

正確答案：B. Human herpesvirus-6